Respecto a la teoría de Herzberg sobre los factores que explican la conducta de los trabajadores, señale cuál de los siguientes es un factor de tipo motivacional:
1. Salario.
2. Categoría.
3. Progreso.
4. Seguridad laboral.

Respuesta correcta: 3. Progreso.